Clinical trial inclusion criterion:
Participants and their families not planning to move away from the area for the duration of the study

Annotated entities:
- Negation: "not"
- Mood: "planning to move away"
- Temporal: "for the duration of the study"
- Reference_point: "the study"